Tras la gastrulación, el epiblasto se transforma en:
1. Endodermo.
2. Mesodermo.
3. Ectodermo.
4. Celoma.
5. Vellosidades coriónicas.

Respuesta correcta: 3. Ectodermo.